一位56歲的男性體檢時發現其血中PSA（prostatic specific antigen）濃度為16 ng/mL（正常值小於4 ng/mL），於是被轉介到醫學中心作進一步的檢查，肛門指檢（digital rectal examination）結果發現其攝護腺（前列腺）大小為5×5 cm，質地 rubbery，無硬結（no hard nodule），亦無壓痛。請問以下何者為較佳之建議？
A. 接受經直腸超音波檢查 ，以及攝護腺（前列腺）穿刺切片
B. 服用α阻斷劑
C. 使用 5α-還原酶抑制劑
D. 使用抗生素

正確答案：A. 接受經直腸超音波檢查 ，以及攝護腺（前列腺）穿刺切片